Clinical trial inclusion criterion:
Between the ages of 21-60

Annotated entities:
- Person: "ages"
- Value: "Between 21-60"